Clinical trial exclusion criterion:
Previous surgical or catheter ablation for atrial fibrillation

Annotated entities:
- Procedure: "catheter ablation"
- Procedure: "ablation surgical"
- Condition: "atrial fibrillation"
- Temporal: "Previous"